動脈韌帶（ligamentum arteriosum），位在那兩條血管之間？
A. 主動脈與肺動脈
B. 肺動脈與上腔靜脈
C. 主動脈與上腔靜脈
D. 主動脈與肺靜脈

正確答案：A. 主動脈與肺動脈